Clinical trial inclusion criterion:
Willingness to eat a chocolate-flavored snack at test sessions and two week training period

Annotated entities:
- Observation: "Willingness to eat a chocolate-flavored snack"
- Temporal: "at test sessions"
- Temporal: "at two week training period"